Clinical trial exclusion criterion:
thrombus in the LA or LAA;

Entity relations:
- Has_qualifier("thrombus", "LA")
- OR("LA", "LAA")